What is the genetic basis of the Delayed Sleep-Phase Syndrome (DSPS)?

We studied the association between the AA-NAT gene and delayed sleep phase syndrome . Association of the length polymorphism in the human Per3 gene with the delayed sleep-phase syndrome: does latitude have an influence upon it?. Recent progress in biological clock research has facilitated genetic analysis of circadian rhythm sleep disorders, such as delayed sleep phase syndrome . One of the haplotypes was significantly associated with DSPS  in our study population. In human leukocyte antigen  typing, the incidence of DR1 positivity alone was significantly higher in DSPS patients than in healthy subjects. Polymorphisms in the CLOCK, BMAL1, Per3 and TIMELESS genes have been associated with susceptibility to mood disorder, and single nucleotide polymorphisms and haplotypes in several circadian genes have been observed among those displaying certain circadian phenotypes, including worse mood in the evening, insomnia in mania and early, middle or late insomnia in depression. The Per3 polymorphism correlated significantly with extreme diurnal preference, the longer allele associating with morningness and the shorter allele with eveningness. The frequency of the 129 threonine allele is significantly higher in the patients than in the controls .